Clinical trial exclusion criterion:
pericardial effusion greater than 10 mm;

Entity relations:
- Has_qualifier("pericardial effusion", "greater than 10 mm")